足底深弓動脈（deep plantar artery）主要由下列何者分支？
A. 弓狀動脈（arcuate artery）
B. 足背動脈（dorsalis pedis artery）
C. 足底內側動脈（medial plantar artery）
D. 足底外側動脈（lateral plantar artery）

正確答案：D. 足底外側動脈（lateral plantar artery）